Pectoral implanted device

The above is a clinical trial inclusion criterion. Annotated with entity spans:
[Device: Pectoral implanted device]